Los diseños experimentales factoriales o también denominados diseños experimentales complejos:
1. Estudian el efecto de una variable independiente sobre varias variables dependientes.
2. Estudian los efectos principales de varias variables independientes y su posible efecto conjunto o de interacción.
3. Son poco adecuados si se sospecha que algunas de las variables del estudio pueden tener efectos de interacción.
4. Pueden prescindir de las técnicas de control experimental por su complejidad.
5. Se basan en la aplicación de todas las condiciones experimentales al mismo grupo de participantes.

Respuesta correcta: 2. Estudian los efectos principales de varias variables independientes y su posible efecto conjunto o de interacción.